Clinical trial exclusion criterion:
Immunosuppressed/immune compromised

Annotated entities:
- Condition: "Immunosuppressed"
- Condition: "immune compromised"